Patient fasting for at least 6 hours.

The above is a clinical trial inclusion criterion. Annotated with entity spans:
Patient [Observation: fasting] [Temporal: for at least 6 hours.]